La reactivación de un citomegalovirus latente, en un paciente inmunodeprimido puede dar lugar a un cuadro sistémico grave. ¿Cómo haría el diagnóstico etológico?
1. Detectando las Ig G específicas en el suero.
2. Por cultivo de la orina en una línea celular avanzada.
3. Por reacción en cadena de la polimerasa cuantitativa en la sangre.
4. Por detección de antígeno en la orina.
5. Por detección de Ig M específicas en el suero.

Respuesta correcta: 3. Por reacción en cadena de la polimerasa cuantitativa en la sangre.